下列有關腎上腺（adrenal gland）的動脈供應，何者正確？
A. 完全由腎動脈（renal artery）的分支供應
B. 完全由腹主動脈（abdominal aorta）的分支供應
C. 完全由腎動脈（renal artery）與腹主動脈（abdominal aorta）的分支供應
D. 由腎動脈（renal artery）、腹主動脈（abdominal aorta）及膈下動脈（inferior phrenic artery）三者的分支供應

正確答案：D. 由腎動脈（renal artery）、腹主動脈（abdominal aorta）及膈下動脈（inferior phrenic artery）三者的分支供應